Abnormal 12-lead electrocardiogram (ECG) at screening or pre-dose (Day -1 or Day 1), except minor deviations deemed to be of no clinical significance by the Investigator.

The above is a clinical trial exclusion criterion. Annotated with entity spans:
[Value: Abnormal] [Procedure: 12-lead electrocardiogram (ECG)] [Temporal: at screening] or [Reference_point: pre-dose] ([Temporal: Day -1] or [Temporal: Day 1]), except minor deviations deemed to be of no clinical significance by the Investigator.